En relación a la estructura de las proteínas:
1. Todas las proteínas globulares tienen los mismos dominios.
2. La estructura terciaria está presente únicamente en proteínas oligoméricas.
3. La hemoglobina es la única proteína que posee estructura cuaternaria.
4. Los dominios de las proteínas son regiones de plegamiento compacto que ejercen una determinada función.
5. Las estructuras terciaria y cuaternaria están mantenidas únicamente por los enlaces peptídicos.

Respuesta correcta: 4. Los dominios de las proteínas son regiones de plegamiento compacto que ejercen una determinada función.